Clinical trial exclusion criterion:
Other contra-indications to liraglutide in accordance with risks and safety information included in the latest updated prescribing information

Entity relations:
- AND("contra-indications", "liraglutide")
- Has_qualifier("contra-indications", "Other")